Clinical trial exclusion criteria:
Therapy area located outside of head and neck;
Other skin diseases that might interfere with the efficacy evaluation;
Therapy area was previously received isotope or PDT or other treatment which might interfere with the efficacy evaluation;
Allergy to porphyrins and analogues; Photosensitivity; Porphyria; Allergic constitution;
Scar diathesis;
Immunocompromised conditions;
Electrocardiographic abnormalities or organic heart diseases;
Coagulation disorders;
Hepatic or renal functions abnormal (alanine aminotransferase or aspartate transaminase or total bilirubin > 1.5 upper limit of normal [ULN], or serum creatinine or blood urea nitrogen > 1.5 ULN);
Psychiatric diseases; Severe endocrinopathies;
Previous therapy of PWS within the last 4 weeks;
Participation in any clinical studies within the last 4 weeks;
Be judged not suitable to participate the study by the investigators

Annotated entities:
- Non-representable: "Therapy area located outside of head and neck;"
- Condition: "skin diseases"
- Qualifier: "interfere with the efficacy evaluation"
- Drug: "isotope"
- Drug: "PDT"
- Procedure: "treatment"
- Qualifier: "might interfere with the efficacy evaluation"
- Condition: "Allergy"
- Drug: "porphyrins"
- Condition: "Photosensitivity"
- Drug: "analogues"
- Condition: "Porphyria"
- Condition: "Allergic constitution"
- Condition: "Scar diathesis"
- Condition: "Immunocompromised conditions"
- Condition: "Electrocardiographic abnormalities"
- Qualifier: "organic"
- Condition: "heart diseases"
- Procedure: "Electrocardiographic"
- Condition: "Coagulation disorders"
- Measurement: "Hepatic functions"
- Measurement: "renal functions"
- Value: "abnormal"
- Measurement: "alanine aminotransferase"
- Measurement: "aspartate transaminase"
- Measurement: "total bilirubin"
- Value: "> 1.5 upper limit of normal [ULN]"
- Measurement: "serum creatinine"
- Measurement: "blood urea nitrogen"
- Value: "> 1.5 ULN"
- Condition: "Psychiatric diseases"
- Qualifier: "Severe"
- Condition: "endocrinopathies"
- Temporal: "Previous"
- Procedure: "therapy"
- Temporal: "within the last 4 weeks"
- Condition: "PWS"
- Observation: "Participation in any clinical studies"
- Temporal: "within the last 4 weeks"
- Non-query-able: "Be judged not suitable to participate the study by the investigators"